一名 3 歲男童因弓形腿（bowleg）就診，實驗室檢查顯示血清鈣離子濃度 8 mg/dL（2.0 mmol/L）（正常值 8.8-10.8 mg/dL），無機磷濃度 3.2 mg/dL（正常值 3.8-6.5 mg/dL），鹼性 磷 酸酶（alkaline phosphatase）濃度 1,000 U/L（正常值145-420 U/L），完整的副甲狀腺素（intact parathyroid hormone）濃度150 pg/mL（正常值9-65 pg/mL），此患者最可能的診斷為：
A. 原發性副甲狀腺高能症（primary hyperparathyroidism）
B. 維生素 D 依賴型佝僂症（vitamin D dependent rickets）
C. 低磷酸鹽血性佝僂症（hypophosphatemic rickets）
D. 鈣攝取不足

正確答案：B. 維生素 D 依賴型佝僂症（vitamin D dependent rickets）